Clinical trial inclusion criterion:
Patients needed to pericardiocentesis during RFCA for paroxysmal or persistent atrial fibrillation.

Annotated entities:
- Procedure: "pericardiocentesis"
- Temporal: "during RFCA"
- Reference_point: "RFCA"
- Procedure: "RFCA"
- Qualifier: "paroxysmal"
- Qualifier: "persistent"
- Condition: "atrial fibrillation"